La reacción de acetato de etilo y acetona en presencia de hidruro de sodio en dietil éter genera, después de la hidrólisis:
1. 2,4-Pentanodiona.
2. 4-Metil-3-penten-2-ona.
3. 3-Oxobutanoato de etilo.
4. 2,3-Pentanodiona.
5. 4-Hidroxi-4-metil-2-pentanona.

Respuesta correcta: 1. 2,4-Pentanodiona.